Clinical trial exclusion criteria:
Visible skin pathology, excessive freckles, or skin blemishes in the test area.
History of skin disease or hypersensitivity and repeated contact allergies.
Sarcoma or squamous cell histology.
Metastatic disease to the breast.
Current tobacco use.

Annotated entities:
- Condition: "skin pathology"
- Condition: "freckles"
- Qualifier: "excessive"
- Condition: "skin blemishes"
- Condition: "skin disease"
- Condition: "hypersensitivity"
- Condition: "contact allergies"
- Condition: "Sarcoma"
- Condition: "squamous cell"
- Procedure: "histology"
- Condition: "Metastatic disease"
- Qualifier: "to the breast"
- Observation: "tobacco use"
- Temporal: "Current"